Cuál de los productos siguientes de la degradación de los triglicéridos y la posterior βoxidación puede experimentar gluconeogénesis:
1. Propionil CoA.
2. Acetil CoA.
3. Todos los cuerpos cetónicos.
4. Algunos aminoácidos.
5. β-Hidroxibutirato.

Respuesta correcta: 1. Propionil CoA.